severe hepatic insufficiency or paracetamol (acetaminophen) is contraindicated for other reason

The above is a clinical trial exclusion criterion. Annotated with entity spans:
[Qualifier: severe] [Condition: hepatic insufficiency] or [Drug: paracetamol] ([Drug: acetaminophen]) is [Condition: contraindicated] for other reason